Clinical trial inclusion criterion:
Estimated glomerular filtration rate (eGFR) > 30 ml/min

Entity relations:
- Has_value("Estimated glomerular filtration rate (eGFR)", "> 30 ml/min")